Clinical trial inclusion criterion:
1. HIV infection with plasma and CSF HIV RNA concentrations (using Roche Amplicor assay) > 1,000 copies/ mL (available after baseline LP).

Entity relations:
- AND("CSF HIV RNA concentration", "Roche Amplicor assay")
- AND("plasma concentration", "Roche Amplicor assay")
- Has_value("plasma concentration", "> 1,000 copies/ mL")
- Has_value("CSF HIV RNA concentration", "> 1,000 copies/ mL")